Patient with a CHADS2VASC score =2

The above is a clinical trial inclusion criterion. Annotated with entity spans:
Patient with a [Measurement: CHADS2VASC score] [Value: =2]